El punto triple del agua se encuentra a 273,16 K y 611 Pascales:
1. En ninguna otra combinación de presión y temperatura es posible encontrar en equilibrio las tres fases del agua.
2. En esas condiciones, el líquido y el vapor se hacen indistinguibles.
3. El proceso de sublimación ocurre a presión superior a 611 pascales.
4. No es posible encontrar vapor por encima de 611 Pascales.
5. No es posible encontrar agua en estado sólido por debajo de 273,16 K.

Respuesta correcta: 1. En ninguna otra combinación de presión y temperatura es posible encontrar en equilibrio las tres fases del agua.